Clinical trial exclusion criterion:
Central nervous system involvement.

Annotated entities:
- Condition: "Central nervous system involvement"